Known hypersensitivity or contraindication to any of the following medications: Heparin, aspirin, clopidogrel, sirolimus, siptagliptin and statin

The above is a clinical trial exclusion criterion. Annotated with entity spans:
Known [Condition: hypersensitivity] or [Condition: contraindication] to any of the following medications: [Drug: Heparin], [Drug: aspirin], [Drug: clopidogrel], [Drug: sirolimus], [Drug: siptagliptin] and [Drug: statin]